The participant has received neurosurgical intervention for Parkinson's disease (e.g., pallidotomy, thalamotomy, deep brain stimulation).

The above is a clinical trial exclusion criterion. Annotated with entity spans:
The participant has received [Procedure: neurosurgical intervention] for [Condition: Parkinson's disease] (e.g., [Condition: pallidotomy], [Condition: thalamotomy], [Condition: deep brain stimulation]).